下列有關評估營養狀態之敘述，何者錯誤？
A. blood urea nitrogen（BUN）若低於8 mg/dL，代表蛋白質的攝取可能不足
B. serum creatinine若低於0.6 mg/dL，代表因長期能量攝取不足而肌肉耗損（muscle wasting）
C. prothrombin time延長，表示可能有維生素 K 缺乏
D. serum total iron binding capacity（TIBC）> 500 µg/dL代表蛋白質攝取不足，可能有惡性營養不良（kwashiorkor）

正確答案：D. serum total iron binding capacity（TIBC）> 500 µg/dL代表蛋白質攝取不足，可能有惡性營養不良（kwashiorkor）